Use of prescribed stimulants (such as amphetamine or dextroamphetamine containing medications) is exclusionary in the 2 weeks prior to the initial screen (P1) visit and prohibited throughout the study. Participants who take these medications will be asked to discontinue them for a minimum of 2 weeks before the Preliminary Screening Period.

The above is a clinical trial exclusion criterion. Annotated with entity spans:
Use of [Drug: prescribed stimulants] (such as [Drug: amphetamine] or [Drug: dextroamphetamine] containing medications) is exclusionary [Temporal: in the 2 weeks prior to the initial screen (P1) visit] and prohibited throughout the study. Participants who take these medications will be asked to discontinue them for a minimum of 2 weeks before the Preliminary Screening Period.